Clinical trial inclusion criterion:
3. Documented radiographic disease progression < 12 months after the last dose of first- or second-line platinum-based chemotherapy.

Annotated entities:
- Parsing_Error: "3."
- Procedure: "radiographic"
- Condition: "disease progression"
- Temporal: "< 12 months after the last dose of first- or second-line platinum-based chemotherapy"
- Reference_point: "the last dose of first- or second-line platinum-based chemotherapy"